Known chronic liver disease, renal disease requiring dialysis or bleeding disorder

The above is a clinical trial exclusion criterion. Annotated with entity spans:
Known [Condition: chronic liver disease], [Condition: renal disease] [Mood: requiring] [Procedure: dialysis] or [Condition: bleeding disorder]